written consent

The above is a clinical trial inclusion criterion. Annotated with entity spans:
[Informed_consent: written consent]